Clinical trial exclusion criterion:
2. Currently breast-feeding

Entity relations:
- Has_temporal("breast-feeding", "Currently")